Clinical trial exclusion criterion:
FEV1/SVC>=70%

Entity relations:
- Has_value("FEV1/SVC", ">=70%")